Use of anti-coagulant treatment such as heparin, warfarin, platelet inhibitors, thrombin and factor X inhibitors.

The above is a clinical trial exclusion criterion. Annotated with entity spans:
Use of [Procedure: anti-coagulant treatment] such as [Drug: heparin], [Drug: warfarin], [Drug: platelet inhibitors], [Drug: thrombin] and [Drug: factor X inhibitors].